List medication interfering with purine metabolism that are used for treatment of T-cell prolymphocytic leukemia?

Deoxycoformycin and pentostatin are purine analogs that interfere with purine metabolism and are used for treatment of T-cell prolymphocytic leukemia patients.